下列何種營養素的缺乏是	酒病人貧血最常見的原因？
A. folic acid
B. vitamin B12
C. iron
D. zinc

正確答案：A. folic acid